Periodontal parameters : Depth Probing (PS), Visible Plaque Index (IPV), Gingival Index (GI) and Probing Bleed Index (SS). The normal included were: PS = 1 to 3 mm, GI = 0, IPV = score 0 e SS = score 0.

The above is a clinical trial inclusion criterion. Annotated with entity spans:
Periodontal parameters : [Measurement: Depth Probing (PS)], [Measurement: Visible Plaque Index (IPV)], [Measurement: Gingival Index (GI)] and [Measurement: Probing Bleed Index (SS)]. The normal included were: [Measurement: PS] [Value: = 1 to 3 mm], [Measurement: GI] [Value: = 0], [Measurement: IPV] = [Value: score 0] e [Measurement: SS] = [Value: score 0].